Clinical trial exclusion criterion:
Patients Level III or greater on the American Society of Anesthesiologists (ASA) physical status classification system (as determined by the anesthesiologist)

Entity relations:
- Has_value("American Society of Anesthesiologists (ASA) physical status", "Level III or greater")